Ta 期膀胱癌經內視鏡完全切除（TUR）後再加上膀胱內藥物灌注之適應症，不包括下列何者？
A. 多發性膀胱癌
B. 復發性膀胱癌
C. 大的膀胱癌
D. 低度分化者

正確答案：D. 低度分化者